Clinical trial inclusion criterion:
Non-reversible airway obstruction (post-bronchodilator FEV1/FVC < 0.7 and FEV1 < 80 %)

Entity relations:
- Has_qualifier("airway obstruction", "Non-reversible")
- Has_qualifier("FEV1/FVC", "post-bronchodilator")
- Has_qualifier("FEV1", "post-bronchodilator")
- Has_value("FEV1", "< 80 %")
- Has_value("FEV1/FVC", "< 0.7")
- Subsumes("airway obstruction", "FEV1/FVC")